History of sensitivity to study medications or any of their excipients

The above is a clinical trial exclusion criterion. Annotated with entity spans:
History of [Condition: sensitivity] to [Drug: study medications] or any of their excipients